Previous antispastic drugs

The above is a clinical trial exclusion criterion. Annotated with entity spans:
[Temporal: Previous] [Drug: antispastic drugs]